Clinical trial exclusion criterion:
With evidence of a local or systemic infection, including urinary tract infection

Annotated entities:
- Condition: "systemic infection"
- Condition: "urinary tract infection"
- Condition: "local infection"